在 colon 的 marginal artery 附近之 Lymph nodes 稱之為：
A. Epicolic nodes
B. Paracolic nodes
C. Intermediate nodes
D. Primary（main）nodes

正確答案：B. Paracolic nodes